Has any progressive form of MS

The above is a clinical trial exclusion criterion. Annotated with entity spans:
Has any [Qualifier: progressive] form of [Condition: MS]